Clinical trial exclusion criterion:
Subjects were not to have donated plasma within 90 days prior to study initiation.

Annotated entities:
- Procedure: "donated plasma"
- Temporal: "within 90 days prior to study initiation"
- Reference_point: "study initiation"
- Negation: "not"